Clinical trial exclusion criterion:
Any debilitating disease that causes exercise intolerance

Entity relations:
- AND("debilitating disease", "exercise intolerance")